Concomitant surgical procedure other than CABG

The above is a clinical trial exclusion criterion. Annotated with entity spans:
[Temporal: Concomitant] [Procedure: surgical procedure] [Qualifier: other than] [Procedure: CABG]